Clinical trial inclusion criteria:
1. Age: 18 years and older.
2. Sex: Male and non-pregnant, non-lactating female
1. Women of childbearing potential must have negative serum (Beta HCG) pregnancy tests performed within 14 days prior to the start of the study and on the evening prior to each dose administration. If dosing is scheduled on Sunday or Monday, the HCG pregnancy test should be given within 48 hours prior to dosing of each study period. An additional serum (Beta HCG) pregnancy test will be performed upon completion of the study.
2. Women of childbearing potential must practice abstinence or be using an acceptable form of contraception throughout the duration of the study. Acceptable forms of contraception include the following:
(1) intrauterine device in place for at least 3 months prior to the start of the study and remaining in place during the study period, or (2) barrier methods containing or used in conjunction with a spermicidal agent, or (3) postmenopausal accompanied with a documented postmenopausal course of at least one year or surgical sterility (tubal ligation, oophorectomy or hysterectomy).
3. During the course of the study, from study screen until study exit - including the washout period, women of childbearing potential must use a spermicide containing barrier method of contraception in addition to their current contraceptive device. This advice should be documented in the informed consent form.
3. Weight: At least 60 kg (132 lbs) for man and 48 kg (106 lbs) for women and within 15% of Ideal Body Weight (IBW), as referenced by the Table of ""Desirable Weights of Adults"" Metropolitan Life Insurance Company, 1999 (See Part II ADMINISTRATIVE ASPECTS OF BIOEQUIVALENCE PROTOCOLS).
4. All subjects should be judged normal and healthy during a pre-study medical evaluation (physical examination, laboratory evaluation, 12-lead ECG, hepatitis B and hepatitis C tests, HIV test, and urine drug screen including amphetamine, barbiturates, benzodiazepine, cannabinoid, cocaine, opiates, phencyclidine, and methadone) performed within 14 days of the initial dose of study medication.

Annotated entities:
- Value: "18 years and older"
- Person: "Age"
- Person: "Male"
- Condition: "pregnant"
- Negation: "non"
- Negation: "non"
- Condition: "lactating"
- Person: "female"
- Person: "Women"
- Condition: "childbearing potential"
- Value: "negative"
- Procedure: "serum pregnancy tests"
- Procedure: "Beta HCG"
- Temporal: "within 14 days prior to the start of the study"
- Reference_point: "the start of the study"
- Temporal: "on the evening prior to each dose administration"
- Reference_point: "each dose administration"
- Person: "Women"
- Condition: "childbearing potential"
- Procedure: "abstinence"
- Qualifier: "acceptable form"
- Procedure: "contraception"
- Temporal: "throughout the duration of the study"
- Device: "intrauterine device"
- Temporal: "for at least 3 months prior to the start of the study"
- Reference_point: "the start of the study"
- Temporal: "in place during the study period"
- Reference_point: "the study period"
- Procedure: "barrier methods"
- Drug: "spermicidal agent"
- Condition: "postmenopausal"
- Temporal: "at least one year"
- Condition: "surgical sterility"
- Procedure: "tubal ligation"
- Procedure: "oophorectomy"
- Procedure: "hysterectomy"
- Person: "women"
- Condition: "childbearing potential"
- Procedure: "spermicide containing barrier method of contraception"
- Multiplier: "in addition to"
- Temporal: "current"
- Device: "contraceptive device"
- Temporal: "During the course of the study"
- Measurement: "Weight"
- Value: "At least 60 kg"
- Value: "At least 132 lbs"
- Person: "man"
- Value: "At least 48 kg"
- Value: "At least 106 lbs"
- Person: "women"
- Value: "within 15% of Ideal Body Weight (IBW)"
- Condition: "normal"
- Condition: "healthy"
- Procedure: "pre-study medical evaluation"
- Procedure: "physical examination"
- Procedure: "laboratory evaluation"
- Procedure: "12-lead ECG"
- Procedure: "hepatitis B tests"
- Procedure: "hepatitis C tests"
- Procedure: "HIV test"
- Procedure: "urine drug screen"
- Qualifier: "amphetamine"
- Qualifier: "barbiturates"
- Qualifier: "benzodiazepine"
- Qualifier: "cannabinoid"
- Qualifier: "cocaine"
- Qualifier: "opiates"
- Qualifier: "phencyclidine"
- Qualifier: "methadone"
- Temporal: "within 14 days of the initial dose of study medication"
- Reference_point: "the initial dose of study medication"